Clinical trial exclusion criterion:
endometrial thickness < 7 mm or no triple layer endometrium and/or functional follicles

Entity relations:
- Has_value("endometrial thickness", "< 7 mm")
- Has_negation("triple layer endometrium", "no")
- OR("triple layer endometrium", "functional follicles")